Clinical trial exclusion criterion:
Known to be human immunodeficiency virus positive

Entity relations:
- Has_value("human immunodeficiency virus", "positive")
- multi("human immunodeficiency virus positive", "human immunodeficiency virus")